¿Cuál de las siguientes es una ventaja del método de la alarma para el tratamiento de la enuresis?
1. Se conoce bien su mecanismo de acción.
2. No requiere despertar al niño de forma programada a lo largo de la noche.
3. Actúa de forma más rápida que la desmopresina.
4. No requiere la ingesta extra de líquidos (sobreaprendizaje) como parte del protocolo de tratamiento.
5. Actúa de forma más rápida que el entrenamiento en cama seca.

Respuesta correcta: 2. No requiere despertar al niño de forma programada a lo largo de la noche.